一位 33 歲女性，在月經週期後，忽然在右乳外側發現有一會痛之硬塊，由於她有乳癌之家族史（母親為乳癌），到乳房外科就診，經檢查後發現病人沒有發燒，乳房皮膚無異狀。在右乳房之外上方處（OUQ）有一約 3 公分，表面平滑緊張（tense）有壓痛之硬塊。宜先進行下列何項檢查最適合？
A. 乳房攝影檢查（mammography）
B. 乳房超音波檢查（breast sonography）
C. 磁振造影（MRI）
D. 粗針穿刺檢查（core needle biopsy）

正確答案：B. 乳房超音波檢查（breast sonography）